Subjects undergoing treatment of statin for hypercholesterolemia

The above is a clinical trial inclusion criterion. Annotated with entity spans:
Subjects undergoing [Procedure: treatment] of [Drug: statin] for [Condition: hypercholesterolemia]